Es agente etiológico de la miasis cutánea:
1. Glossina palpalis.
2. Dermatobia hominis.
3. Simulimum damnosum.
4. Pulex irritans.
5. Tunga penetrans.

Respuesta correcta: 2. Dermatobia hominis.